Clinical trial exclusion criterion:
Diagnosed or treated for another malignancy within 2 years before study enrollment or previously diagnosed with another malignancy and have any evidence of residual disease. Participants with non-melanoma skin cancer or carcinoma in situ of any type are not excluded if they have undergone complete resection.

Entity relations:
- Has_qualifier("malignancy", "another")
- Has_temporal("malignancy", "within 2 years before study enrollment")
- Has_temporal("malignancy", "previously")
- Has_mood("residual disease", "any evidence of")
- Has_qualifier("carcinoma in situ", "any type")
- Has_negation("complete resection", "not excluded")
- AND("non-melanoma skin cancer", "complete resection")
- OR("malignancy", "malignancy")
- OR("non-melanoma skin cancer", "carcinoma in situ")